Acute or chronic disease

The above is a clinical trial exclusion criterion. Annotated with entity spans:
[Condition: Acute] or [Condition: chronic disease]